Clinical trial inclusion criterion:
Residual clinically or radiographically evident tumor, including primary cutaneous and mucosal melanomas

Annotated entities:
- Condition: "tumor"
- Procedure: "radiographically"
- Qualifier: "Residual"
- Value: "evident"
- Procedure: "clinically"
- Condition: "primary cutaneous"
- Condition: "mucosal melanomas"